Clinical trial exclusion criterion:
Active opioid dependence

Annotated entities:
- Qualifier: "Active"
- Condition: "opioid dependence"